Alcohol or illicit drug use, which in the investigators opinion may affect participation in study.

The above is a clinical trial exclusion criterion. Annotated with entity spans:
[Observation: Alcohol] or [Observation: illicit drug use], which in the investigators opinion may affect participation in study.